Clinical trial inclusion criterion:
= 5 episodes of VT treated with antitachycardia pacing (ATP) regardless of symptoms

Entity relations:
- Subsumes("antitachycardia pacing", "ATP")
- Has_multiplier("VT", "5 episodes")
- AND("VT", "antitachycardia pacing")